Radiation exposures exceeding annual Rad Worker limits.

The above is a clinical trial exclusion criterion. Annotated with entity spans:
[Measurement: Radiation exposures] [Value: exceeding annual Rad Worker limits].